Concurrent participation in any other clinical trial without written agreement of the two study teams

The above is a clinical trial exclusion criterion. Annotated with entity spans:
[Competing_trial: Concurrent participation in any other clinical trial without written agreement of the two study teams]